Se está diseñando un comprimido con cubierta pelicular gastrosoluble. ¿Cuál de los siguientes excipientes ejerce la función de plastificante en dicha cubierta?:
1. Hidroxipropilmetilcelulosa.
2. Metilcelulosa.
3. Copolímero del ácido metacrílico (Eudragit® E30D (A))
4. Polietilenglicol.
5. Óxido de titanio.

Respuesta correcta: 4. Polietilenglicol.